Clinical trial inclusion criteria:
Female with a persisting pregnancy of unknown location:
A pregnancy of unknown location is defined as a pregnancy in a woman with a positive pregnancy test but no definitive signs of pregnancy in the uterus or adnexa on ultrasound imaging. A definitive sign of gestation includes ultrasound visualization of a gestational sac with a yolk sac (with or without an embryo) in the uterus or in the adnexa. Ultrasound must be performed within 7 days prior to randomization.
Persistence of hCG is defined as at least 2 serial hCG values (over 2-14 days), showing < 15% rise per day, or < 50% fall between the first and last value.
Patient is hemodynamically stable, hemoglobin >10 mg/dL
Greater than or 18 years of age

Annotated entities:
- Person: "Female"
- Condition: "pregnancy"
- Qualifier: "unknown location"
- Parsing_Error: ":"
- Condition: "pregnancy"
- Qualifier: "unknown location"
- Condition: "pregnancy"
- Person: "woman"
- Measurement: "pregnancy test"
- Value: "positive"
- Not_a_criteria: "A pregnancy of unknown location is defined as a pregnancy in a woman with a positive pregnancy test but no definitive signs of pregnancy in the uterus or adnexa on ultrasound imaging."
- Parsing_Error: "A definitive sign of gestation includes ultrasound visualization of a gestational sac with a yolk sac (with or without an embryo) in the uterus or in the adnexa."
- Procedure: "Ultrasound"
- Not_a_criteria: "A definitive sign of gestation includes ultrasound visualization of a gestational sac with a yolk sac (with or without an embryo) in the uterus or in the adnexa."
- Temporal: "within 7 days prior to randomization"
- Reference_point: "randomization"
- Condition: "Persistence of hCG"
- Measurement: "hCG"
- Multiplier: "at least 2"
- Temporal: "over 2-14 days"
- Value: "< 15% rise per day"
- Value: "< 50% fall between the first and last value."
- Condition: "hemodynamically stable"
- Measurement: "hemoglobin"
- Value: ">10 mg/dL"
- Value: "Greater than or 18 years"
- Person: "age"